BMI less than 35

The above is a clinical trial inclusion criterion. Annotated with entity spans:
[Measurement: BMI] [Value: less than 35]